Taking an NNRTI or integrase containing regimen with prior exposure to PI greater than 2 weeks. It must be clearly stated in the source document that PI was switched to another agent for convenience.

The above is a clinical trial inclusion criterion. Annotated with entity spans:
Taking an [Drug: NNRTI] or [Drug: integrase] containing [Procedure: regimen] with [Temporal: prior] exposure to [Drug: PI] [Temporal: greater than 2 weeks]. It must be clearly stated in the source document that PI was switched to another agent for convenience.